In which chromosome are transgenes inserted in the case of the LiPS-A3S line?

The LiPS-A3S line of human pluripotent stem cells is inserted into chromosome 15.